Clinical trial inclusion criterion:
patients undergoing partial or full resection of the pancreas due to a benign or malignant tumor

Annotated entities:
- Procedure: "full resection of the pancreas"
- Procedure: "partial resection of the pancreas"
- Condition: "malignant tumor"
- Condition: "benign tumor"